Clinical trial inclusion criterion:
Two well-characterized mutations in the cystic fibrosis transmembrane conductance regulator (CFTR) gene

Annotated entities:
- Multiplier: "Two"
- Condition: "mutations"
- Condition: "cystic fibrosis transmembrane conductance regulator gene"
- Condition: "CFTR"